not a regular user of e-cigarettes

The above is a clinical trial exclusion criterion. Annotated with entity spans:
[Negation: not] a [Person: regular user] of [Procedure: e-cigarettes]